張先生 60 歲，因罹患高血壓、糖尿病長期規律服藥，最近 2 天，走幾步路就會呼吸急促，睡覺時無法平躺，坐著呼吸才比較舒服，另外走路時胸口悶痛，坐著休息時胸悶就比較緩解，最近胸痛的頻率也比以前增加。張先生到急診求診，血壓 160/90 毫米汞柱，心跳每分鐘 130 下，體溫攝氏 37 度，呼吸每分鐘 25 次，在無使用氧氣之下的血氧濃度 88%，身體診查呈現如下，頸靜脈怒張（jugular vein engorgement），於心尖處有第 2 度（Grade II/VI）心收縮雜音，S3 奔跑音（S3 gallop），雙側均有肺囉音（rales），雙下肢水腫，心電圖呈現竇性心搏過速（sinus tachycardia）與 V4-V6 有 ST 段下降，胸部 X 光片呈現心臟肥大與肺水腫，對於張先生此次到急診的診斷，下列何者最不恰當？
A. 心臟衰竭
B. 肺心症（cor pulmonale）
C. 急性肺水腫
D. 急性冠心症

正確答案：B. 肺心症（cor pulmonale）